Patients with plan to decannulate from ECMO within 48 hours

The above is a clinical trial exclusion criterion. Annotated with entity spans:
Patients with plan to [Procedure: decannulate from ECMO] [Temporal: within 48 hours]